Clinical trial exclusion criterion:
Known creatinine clearance <30 mL/minute or on hemodialysis.

Annotated entities:
- Measurement: "creatinine clearance"
- Value: "<30 mL/minute"
- Procedure: "hemodialysis"